Clinical trial exclusion criterion:
Significant communicative impairments

Entity relations:
- Has_qualifier("communicative impairments", "Significant")